What is the main focus of the CVE R/Bioconductor package?

CVE is an R package for interactive variant prioritisation in precision oncology. Leveraging Oncotator and the Drug Gene Interaction Database, CVE offers exploration of variants within single or multiple tumour exomes to identify drivers, resistance mechanisms and to assess druggability.